¿Cuál de estas observaciones es explicada mediante el denominado “efecto del par inerte”?
1. El aluminio sólo presenta estado de oxidación +3.
2. Los gases nobles forman muy pocos compuestos.
3. El talio presenta estados de oxidación +1 y +3.
4. El hierro presenta estados de oxidación +2 y +3.

Respuesta correcta: 3. El talio presenta estados de oxidación +1 y +3.